下列何種情形可不需立刻通報兒少保護小組？
A. 4歲男童無法行走，3日後檢查發現右股骨骨折，已是今年第3次外傷就醫
B. 2個月女嬰頭皮血腫合併硬腦膜下出血
C. 4歲男童攀爬遊戲器材時跌落，手腳多處挫傷擦傷
D. 4歲女童據家屬描述走路跌倒後便無法行走，現就醫發現左股骨骨折

正確答案：C. 4歲男童攀爬遊戲器材時跌落，手腳多處挫傷擦傷